Without basal disorders of neurology and psychiatrics

The above is a clinical trial inclusion criterion. Annotated with entity spans:
[Negation: Without] [Condition: basal disorders of neurology] and psychiatrics